Clinical trial inclusion criterion:
abstinent from any tobacco/nicotine use for 4 hours prior to imaging

Annotated entities:
- Condition: "abstinent"
- Drug: "tobacco"
- Drug: "nicotine"
- Temporal: "for 4 hours prior to imaging"
- Reference_point: "imaging"